What are the effects of 14-3-3 dimers on Tau phosphorylation?

14-3-3 dimers have two contrasting effects on Tau phosphorylation: (i) they increase the rate of Tau is phosphorylated by cAMP-dependent protein kinase and (ii) they prevent the relaxation of the autophagic state of Tau.